pregnancy/ breastfeeding

The above is a clinical trial exclusion criterion. Annotated with entity spans:
[Pregnancy_considerations: pregnancy/ breastfeeding]